Joven que acude a urgencias por quemadura por llama de segundo grado del 10 % de la superficie corporal, afectando al brazo derecho de forma extensa y circular. No se halla pulso arterial en la mano medido por doppler. ¿Cuál es el tratamiento de elección?
1. Curas con sulfadiacina argéntica oclusivas y evaluación de la profundidad a la semana.
2. Drenajes linfáticos y valorar un by-pass vascular.
3. Escarotomía o incisiones de descompresión de urgencia.
4. Conducta expectante.
5. Amputación de la extremidad.

Respuesta correcta: 3. Escarotomía o incisiones de descompresión de urgencia.